Clinical trial exclusion criterion:
Positive drug addictions* (verbal interrogatory)

Annotated entities:
- Condition: "Positive drug addictions"
- Procedure: "verbal interrogatory"